Clinical trial inclusion criterion:
Platelet count greater than or equal to 100 x 10^9/L

Annotated entities:
- Measurement: "Platelet count"
- Value: "greater than 100 x 10^9/L"
- Value: "equal to 100 x 10^9/L"